26 歲男性愛滋病患皮膚上發現一小結狀病變。切片顯示其中有多數中性球浸潤，血管增生，以及許多革蘭氏陰性桿菌。下列病變中何者最符合上述病理變化？
A. Kaposi sarcoma
B. Pyogenic granuloma
C. Bacillary angiomatosis
D. Mycobacterial granuloma

正確答案：C. Bacillary angiomatosis